Clinical trial exclusion criterion:
7. Patients who have had HSCT and are within 100 days of transplant and/or are still taking immunosuppressive drugs and/or have clinically significant graft-versus-host disease requiring treatment and/or have >Grade 1 persistent non hematological toxicity related to the transplant

Entity relations:
- Has_temporal("HSCT", "have had")
- multi("within 100 days of transplant", "transplant")
- multi("transplant", "transplant")
- Has_mood("treatment", "requiring")
- AND("graft-versus-host disease", "treatment")
- Has_qualifier("graft-versus-host disease", "clinically significant")
- multi("persistent", "persistent")
- Has_qualifier("toxicity", "non hematological")
- Has_qualifier("toxicity", "persistent")
- causal("toxicity", "transplant")
- Has_qualifier("toxicity", ">Grade 1")
- Has_temporal("immunosuppressive drugs", "still")
- causal("transplant", "HSCT")
- causal("immunosuppressive drugs", "HSCT")
- causal("graft-versus-host disease", "transplant")
- OR("transplant", "immunosuppressive drugs", "graft-versus-host disease", "toxicity")